Test positive at screening for human immunodeficiency virus (HIV), hepatitis B surface antigen (HbsAg), or hepatitis C virus (HCV)

The above is a clinical trial exclusion criterion. Annotated with entity spans:
Test [Value: positive] [Temporal: at screening] for [Measurement: human immunodeficiency virus (HIV)], [Measurement: hepatitis B surface antigen (HbsAg)], or [Measurement: hepatitis C virus (HCV)]